no history of significant skin disease such as, but not limited to rash or eruptions, drug allergies, food allergy, dermatitis, eczema, psoriasis, or urticaria

The above is a clinical trial exclusion criterion. Annotated with entity spans:
no [Temporal: history] of [Qualifier: significant] [Condition: skin disease] such as, but not limited to [Condition: rash] or [Condition: eruptions], [Condition: drug allergies], [Condition: food allergy], [Condition: dermatitis], [Condition: eczema], [Condition: psoriasis], or [Condition: urticaria]